Current or planned incarceration or other involuntary detention

The above is a clinical trial exclusion criterion. Annotated with entity spans:
[Temporal: Current] or [Mood: planned] [Observation: incarceration] or other [Observation: involuntary detention]